Poor oral hygiene on a non-compliant individual

The above is a clinical trial exclusion criterion. Annotated with entity spans:
[Condition: Poor oral hygiene] on a [Observation: non-compliant] individual